Clinical trial inclusion criterion:
1. Fasting glucose > 7.0 or have diabetes medication;

Entity relations:
- Has_value("Fasting glucose", "> 7.0")
- OR("Fasting glucose", "diabetes medication")